智商是評估智力的重要參考，以魏氏智力量表的智商分數為例，常模的平均數（mean）約等於 100，標準差（standard deviation, SD）約等於 15，判斷為輕度智能障礙是智商介於常模平均數的幾個 SD 範圍？
A. 1～2 SD
B. 2～3 SD
C. 3～4 SD
D. 4～5 SD

正確答案：B. 2～3 SD